Clinical trial exclusion criterion:
Patients with brain metastases or any history of brain metastases

Annotated entities:
- Condition: "brain metastases"
- Condition: "brain metastases"
- Temporal: "history"